Plans to move from Kansas City during the treatment and follow-up phase

The above is a clinical trial exclusion criterion. Annotated with entity spans:
[Non-query-able: Plans to move from Kansas City during the treatment and follow-up phase]